En la técnica de espectrometría de absorción atómica, la utilización de un atomizador electrotérmico en lugar de la llama proporciona:
1. Mayor exactitud.
2. Mayor precisión.
3. Mayor consumo de muestra.
4. Tiempos de análisis más largos.
5. Mayor sensibilidad.

Respuesta correcta: 5. Mayor sensibilidad.